• History of uveitis confirmed by an ophthalmologist

The above is a clinical trial inclusion criterion. Annotated with entity spans:
• [Temporal: History] of [Condition: uveitis] [Non-representable: confirmed by an ophthalmologist]